Clinical trial inclusion criterion:
For patients previously treated with alglucosidase alfa the patient has received alglucosidase alfa for at least 6 months.

Annotated entities:
- Non-representable: "For patients previously treated with alglucosidase alfa"
- Drug: "alglucosidase alfa"
- Temporal: "for at least 6 months"